Clinical trial exclusion criterion:
History of keratitis, ulcerative keratitis or severe dry eye.

Entity relations:
- Has_qualifier("dry eye", "severe")
- OR("keratitis", "ulcerative keratitis", "dry eye")